Patients with severe-complicated disease that would compromise oral therapy (hypotenstion or shock, ileus or bowel obstruction, megacolon).

The above is a clinical trial exclusion criterion. Annotated with entity spans:
[Non-query-able: Patients with severe-complicated disease that would compromise oral therapy] ([Condition: hypotenstion] or [Condition: shock], [Condition: ileus] or [Condition: bowel obstruction], [Condition: megacolon]).